造成塵肺症之危害因素屬於下列何類型？
A. 物理性危害
B. 化學性危害
C. 生物性危害
D. 人體工學危害

正確答案：B. 化學性危害